Clinical trial exclusion criterion:
Contraindications to injecting Dotarem ®

Annotated entities:
- Condition: "Contraindications"
- Drug: "Dotarem"